Clinical trial inclusion criterion:
Taking Kaletra containing regimen with suppressed viral load.

Annotated entities:
- Drug: "Kaletra"
- Measurement: "viral load"
- Value: "suppressed"
- Procedure: "regimen"